Clinical trial exclusion criterion:
Potentially unreliable subjects, and those judged by the investigator to be unsuitable for the study.

Annotated entities:
- Observation: "unreliable subjects"
- Non-representable: "Potentially"
- Observation: "unsuitable for the study"
- Non-representable: "judged by the investigator"